Male and female patients, age 18-75 yrs.

The above is a clinical trial inclusion criterion. Annotated with entity spans:
[Person: Male] and [Person: female] patients, [Person: age] [Value: 18-75 yrs].